Which siRNA based drug is in clinical trials for the treatment of pancreatic cancer?

siG12D-LODER™